對 insulin 具有耐受性的糖尿病患者因同時有水腫的問題需作治療改善，不宜使用下列何種利尿劑？
A. chlorothiazide
B. acetazolamide
C. furosemide
D. spironolactone

正確答案：A. chlorothiazide